Subjects with weight that varies greater than 20% over the past 3 months.

The above is a clinical trial exclusion criterion. Annotated with entity spans:
Subjects with [Measurement: weight] that [Qualifier: varies greater than 20%] [Temporal: over the past 3 months].